any condition that in the opinion of the attending physician could endanger the health of the participant or render her unsuitable to participate in the trial

The above is a clinical trial exclusion criterion. Annotated with entity spans:
[Non-query-able: any condition that in the opinion of the attending physician could endanger the health of the participant or render her unsuitable to participate in the trial]